Para silenciar el ARN mensajero (ARNm) los siARN y los miARN se unen generalmente a su:
1. Caja TATA.
2. 5´-UTR.
3. Casquete 5´.
4. 3´-UTR.
5. Cola de poli (A) 3.

Respuesta correcta: 4. 3´-UTR.